Clinical trial inclusion criterion:
Eastern Cooperative Oncology Group (ECOG) Performance status ≤ 2

Entity relations:
- Has_value("Eastern Cooperative Oncology Group (ECOG) Performance status", "≤ 2")